What is a prolactinoma and where in the body would they be found?

Prolactinomas are the most common functional tumors of the pituitary gland.